What is the indication for zolmitriptan?

Zolmitriptan is an effective medicine used in the treatment of migraine.